Clinical trial exclusion criterion:
oxycodone contraindicated

Entity relations:
- AND("contraindicated", "oxycodone")